Clinical trial exclusion criterion:
History of vitrectomy surgery, submacular surgery, or other surgical intervention for RVO

Annotated entities:
- Procedure: "vitrectomy surgery"
- Procedure: "submacular surgery"
- Procedure: "surgical intervention"
- Condition: "RVO"